健康教育最終的目標是養成：
A. 健康知識
B. 健康信念
C. 健康態度
D. 健康行為

正確答案：D. 健康行為